Clinical trial exclusion criterion:
Male sterilization (at least 6 months prior to screening). For female subjects on the study the vasectomized male partner should be the sole partner for that subject.

Entity relations:
- Has_index("at least 6 months prior to screening", "screening")
- Has_temporal("Male sterilization", "at least 6 months prior to screening")